Clinical trial exclusion criterion:
Positive serological tests such as AIDS, hepatitis B virus, hepatitis C virus and syphilis （antigen or antibody）.

Entity relations:
- OR("AIDS", "hepatitis C virus", "hepatitis B virus", "syphilis")